History of allergic disease or reactions likely to be exacerbated by any component of the vaccines.

The above is a clinical trial exclusion criterion. Annotated with entity spans:
[Temporal: History] of [Condition: allergic disease] or [Condition: reactions] likely to be [Qualifier: exacerbated] by any component of the vaccines.